Clinical trial inclusion criterion:
patient infected by multi drug resistant Gram negative bacteria susceptibly only to colistin

Entity relations:
- Has_multiplier("colistin", "only")
- AND("susceptibly", "colistin")
- Has_qualifier("Gram negative bacteria", "multi drug resistant")
- Has_context("Gram negative bacteria", "susceptibly")